Clinical trial inclusion criterion:
Abdominal obesity (>88cm women, >102cm men) AND hypertension (treated or resting blood pressure >140/90

Annotated entities:
- Condition: "Abdominal obesity"
- Value: ">88cm"
- Value: ">102cm"
- Measurement: "Abdominal"
- Person: "women"
- Person: "men"
- Condition: "hypertension"
- Procedure: "treated"
- Measurement: "resting blood pressure"
- Value: ">140/90"